Patients actively listed for transplantation at time of entry into the study or anticipated to undergo heart transplantation, interventional catheterization, or corrective cardiac surgery during the 7 months following entry into the study

The above is a clinical trial exclusion criterion. Annotated with entity spans:
Patients actively [Mood: listed for transplantation] [Temporal: at time of entry into the study] or [Mood: anticipated to undergo] [Procedure: heart transplantation], [Procedure: interventional catheterization], or [Procedure: corrective cardiac surgery] [Temporal: during the 7 months following entry into the study]